Clinical trial exclusion criterion:
Women with previous SLNBx or axillary node dissection

Annotated entities:
- Person: "Women"
- Procedure: "SLNBx"
- Procedure: "axillary node dissection"
- Qualifier: "previous"